Clinical trial exclusion criterion:
Sensitivity to Mebeverine

Entity relations:
- AND("Sensitivity", "Mebeverine")